中樞神經組織中，可以產生腦脊髓液（cerebrospinal fluid）的是：
A. 膜絡叢（choroid plexus）
B. 星狀膠細胞（astrocytes）
C. 蜘蛛網膜顆粒（arachnoid granulations）
D. 神經氈（neuropils）

正確答案：A. 膜絡叢（choroid plexus）